Age between 18-50 years old,

The above is a clinical trial inclusion criterion. Annotated with entity spans:
[Person: Age] [Value: between 18-50 years old],